Clinical trial exclusion criterion:
Fructose intolerance, glucose-galactose malabsorption or sucrose-isomaltase insufficiency.

Annotated entities:
- Condition: "Fructose intolerance"
- Condition: "glucose-galactose malabsorption"
- Condition: "sucrose-isomaltase insufficiency"